一位 68 歲男性患者於 8 個月前被診斷為非小細胞型肺癌後，持續進行化學治療中。此次因嚴重氣喘而來急診，胸部 X 光發現有左側氣胸，右肺有許多結節，經放左側胸管後肺部仍未張開。請問接下來的處置，何者錯誤？
A. 做氣管鏡來看是否為腫瘤阻礙，造成肺部塌陷
B. 做電腦斷層看腫瘤之侵犯情形與是否壓迫呼吸道
C. 做光動力療法來打通氣管
D. 放氣管支架來撐開呼吸道

正確答案：C. 做光動力療法來打通氣管